Clinical trial exclusion criterion:
Pressure sores where harness would be applied

Entity relations:
- AND("Pressure sores", "harness")